Clinical trial exclusion criterion:
History of intracranial hemorrhage

Entity relations:
- Has_temporal("intracranial hemorrhage", "History")